Clinical trial inclusion criterion:
Patients suspected to have vitamin B12 deficiency defined as a plasma vitamin B12 below the reference interval (<200 pmol/L).

Annotated entities:
- Condition: "vitamin B12 deficiency"
- Mood: "suspected"
- Measurement: "plasma vitamin B12"
- Value: "below the reference interval"
- Value: "<200 pmol/L"